Which domain of the MOZ/MYST3 protein complex associates with histone H3?

MOZ/MYST3 complex associates with histone H3 with PHD finger domain.